NYHA IV:Unable to carry on any physical activity without discomfort. Symptoms at rest can be present. If any physical activity is undertaken, discomfort increased.

The above is a clinical trial inclusion criterion. Annotated with entity spans:
[Non-query-able: NYHA IV:Unable to carry on any physical activity without discomfort. Symptoms at rest can be present. If any physical activity is undertaken, discomfort increased].